Clinical trial exclusion criterion:
Treated with an investigational RA drug in the last 6 months

Annotated entities:
- Qualifier: "investigational"
- Drug: "RA drug"
- Temporal: "in the last 6 months"